Clinical trial inclusion criterion:
Adult participants with low or intermediate-1 risk MDS

Annotated entities:
- Person: "Adult"
- Measurement: "MDS"
- Value: "intermediate-1 risk"
- Value: "low risk"